Active smoking during the last 12 months from screening date.

The above is a clinical trial exclusion criterion. Annotated with entity spans:
[Condition: Active smoking] [Temporal: during the last 12 months from screening date].